As of 2019, what type of cancer is commonly associated with ionizing radiation

Ionizing radiation is commonly associated with lung cancer, prostate cancer, breast cancer, cervical intraepithelial neoplasia and oral squamous cell carcinoma.